下列何種藥物可結合至 FK-binding protein，抑制 calcineurin，進而抑制 T cell 活化？
A. cyclosporine
B. sirolimus
C. tacrolimus
D. cyclophosphamide

正確答案：C. tacrolimus